Which enzymes are responsible for base J creation in Trypanosoma brucei?

JBP2 and JBP1